SpO2 < 90 %

The above is a clinical trial exclusion criterion. Annotated with entity spans:
[Measurement: SpO2] [Value: < 90 %]